previous gastric surgery

The above is a clinical trial exclusion criterion. Annotated with entity spans:
[Temporal: previous] [Procedure: gastric surgery]